Treatment with immunosuppressants (e.g. cyclosporine and tacrolimus)

The above is a clinical trial exclusion criterion. Annotated with entity spans:
Treatment with [Drug: immunosuppressants] (e.g. [Drug: cyclosporine] and [Drug: tacrolimus])